Clinical trial exclusion criterion:
unable to lie flat on the scanner for extended periods of time

Annotated entities:
- Post-eligibility: "unable to lie flat on the scanner for extended periods of time"